Clinical trial inclusion criteria:
= 18 years
High risk patients: General Surgery AKI Risk Index Class III, IV or V
Major abdominal surgery

Annotated entities:
- Person: "= 18 years"
- Value: "= 18 years"
- Condition: "High risk"
- Measurement: "General Surgery AKI Risk Index"
- Value: "Class III, IV or V"
- Procedure: "Major abdominal surgery"